Female patients who are pregnant or breastfeeding before or during the three-year follow-up

The above is a clinical trial exclusion criterion. Annotated with entity spans:
[Pregnancy_considerations: Female patients who are pregnant or breastfeeding before or during the three-year follow-up]